造成老年人術後短腸症（short bowel syndrome）最常見的原因為何？
A. 發炎性腸疾患（inflammatory bowel disease）
B. 腸套疊（intussusception）
C. 腸繫膜血管阻塞（mesenteric vascular occlusion）
D. 小腸腫瘤（intestinal neoplasm）

正確答案：C. 腸繫膜血管阻塞（mesenteric vascular occlusion）